What is Progeria?

Progeria is a rare genetic disorder, characterized by progressive premature aging and early death in the first or second decade of life, usually secondary cardiovascular events (myocardial infarction and stroke).